Willing to use the NuvaRing as directed

The above is a clinical trial inclusion criterion. Annotated with entity spans:
[Observation: Willing to use] the [Drug: NuvaRing] as directed